Clinical trial exclusion criterion:
Severe claustrophobia

Entity relations:
- Has_qualifier("claustrophobia", "Severe")